Clinical trial exclusion criterion:
Operative findings not suggestive of endometriotic cyst

Entity relations:
- Has_negation("suggestive", "not")
- AND("Operative findings", "endometriotic cyst")
- Has_mood("endometriotic cyst", "suggestive")